Clinical trial inclusion criterion:
patients were 18 years old or more,

Annotated entities:
- Value: "18 years old or more"
- Person: "old"